Clinical trial exclusion criterion:
Allergic to the medications

Entity relations:
- AND("Allergic", "medications")